口服排卵藥clomiphene citrate，對下列何者一定無效？
A. Hypothalamic-pituitary dysfunction
B. Hypothalamic-pituitary failure
C. 多囊性卵巢症候群
D. 子宮內膜異位症

正確答案：B. Hypothalamic-pituitary failure